Clinical trial inclusion criteria:
18 years of age or older
Histologically confirmed diagnosis of melanoma, breast cancer or gynecologic cancer at MSKCC
Have one of the following disease histories:
Newly-diagnosed or recurrent (local, regional, metastatic) malignant melanoma or breast cancer patients in whom SLN mapping is indicated
Residual clinically or radiographically evident tumor, including primary cutaneous and mucosal melanomas
Prior radiation therapy, chemotherapy, or surgery in patients requiring flap reconstruction in the head and neck region.
Newly diagnosed patients with previous excisional biopsy. OR
Newly-diagnosed gynecologic cancer patients in whom SLN mapping and surgical excision is indicated OR
Normal baseline cardiac function based upon pre-operative evaluation
At the discretion of the operating surgeon, ANC>1000/mcl and platelets>100,000/mcl.
At the discretion of the operating surgeon, Bilirubin level of < 2.0 mg/dl in the absence of a history of Gilbert's disease (or pattern consistent with Gilbert's).
For melanoma patients, If patients have a history of malignancy other than melanoma, and other skin cancers in the past five years, their inclusion is up to the discretion of the physician.
All patients of childbearing and child-creating age must be using an acceptable form of birth control
Women who are pre-menopausal must have a negative serum pregnancy test

Annotated entities:
- Person: "age"
- Value: "18 years or older"
- Condition: "melanoma"
- Procedure: "Histologically"
- Value: "confirmed"
- Condition: "breast cancer"
- Condition: "gynecologic cancer"
- Visit: "MSKCC"
- Parsing_Error: "Have one of the following disease histories:"
- Condition: "malignant melanoma"
- Condition: "breast cancer"
- Qualifier: "local"
- Qualifier: "regional"
- Qualifier: "metastatic"
- Temporal: "Newly-diagnosed"
- Multiplier: "recurrent"
- Condition: "tumor"
- Procedure: "radiographically"
- Qualifier: "Residual"
- Value: "evident"
- Procedure: "clinically"
- Condition: "primary cutaneous"
- Condition: "mucosal melanomas"
- Procedure: "radiation therapy"
- Procedure: "chemotherapy"
- Procedure: "surgery"
- Procedure: "flap reconstruction"
- Condition: "requiring flap reconstruction"
- Qualifier: "head and neck region"
- Temporal: "Prior"
- Procedure: "excisional biopsy"
- Temporal: "previous"
- Condition: "gynecologic cancer"
- Procedure: "SLN mapping"
- Procedure: "surgical excision"
- Condition: "surgical excision is indicated"
- Condition: "SLN mapping is indicated"
- Measurement: "cardiac function"
- Value: "Normal"
- Measurement: "baseline"
- Procedure: "pre-operative evaluation"
- Temporal: "pre-operative"
- Subjective_judgement: "At the discretion of the operating surgeon"
- Measurement: "ANC"
- Value: ">1000/mcl"
- Measurement: "platelets"
- Value: ">100,000/mcl"
- Subjective_judgement: "At the discretion of the operating surgeon"
- Measurement: "Bilirubin level"
- Value: "< 2.0 mg/dl"
- Condition: "Gilbert's disease"
- Negation: "in the absence of"
- Temporal: "history"
- Condition: "melanoma"
- Condition: "malignancy"
- Condition: "melanoma"
- Negation: "other than"
- Condition: "skin cancers"
- Temporal: "in the past five years"
- Subjective_judgement: "up to the discretion of the physician"
- Grammar_Error: "and"
- Temporal: "history"
- Post-eligibility: "All patients of childbearing and child-creating age must be using an acceptable form of birth control"
- Person: "Women"
- Condition: "pre-menopausal"
- Measurement: "serum pregnancy test"
- Value: "negative"